What is the Lupus Severity Index (LSI)?

The Lupus Severity Index (LSI) is a simple, reliable, and valid measure of disease severity in patients with systemic lupus erythematosus.